Clinical trial exclusion criterion:
Known hypersensitive reaction to cinnamon.

Annotated entities:
- Condition: "hypersensitive reaction to cinnamon"
- Observation: "cinnamon"